La polarografía de barrido lineal utiliza un electrodo de trabajo de:
1. Gotas de mercurio.
2. Gotas de yodo.
3. Platino.
4. Calomelanos.
5. Gotas de nitrato de cerio.

Respuesta correcta: 1. Gotas de mercurio.